Diagnosis of brainstem glioma

The above is a clinical trial exclusion criterion. Annotated with entity spans:
Diagnosis of [Condition: brainstem glioma]